Which type of distance is used in the R-package XenofilteR?

XenofilteR separates mouse from human sequence reads based on the edit-distance between a sequence read and reference genome.